Duration of SCI =1 year;

The above is a clinical trial inclusion criterion. Annotated with entity spans:
Duration of [Condition: SCI] [Temporal: =1 year];